5. Self-rating anxiety scale (SAS) and self-rating depression scale (SDS) scores < 50

The above is a clinical trial inclusion criterion. Annotated with entity spans:
5. [Measurement: Self-rating anxiety scale] ([Measurement: SAS]) and [Measurement: self-rating depression scale] ([Measurement: SDS]) [Value: scores < 50]